Clinical trial exclusion criterion:
previous thoracic surgery or thrombolytic therapy for pleural infection;

Annotated entities:
- Procedure: "thoracic surgery"
- Procedure: "thrombolytic therapy"
- Condition: "pleural infection"
- Temporal: "previous"